Clinical trial exclusion criterion:
Current or previous history of analgesic dependence

Annotated entities:
- Temporal: "Current"
- Temporal: "previous"
- Temporal: "history"
- Condition: "analgesic dependence"
- Drug: "analgesic"